Presence of hearing loss

The above is a clinical trial exclusion criterion. Annotated with entity spans:
Presence of [Condition: hearing loss]